En el ámbito de la esquizofrenia señale cuál de los módulos de habilidades sociales para vivir de forma independiente NO forma parte del programa desarrollado por Liberman y colaboradores:
1. Módulo de reintegración en la comunidad.
2. Módulo de control/manejo de abuso de sustancias (patología dual).
3. Módulo de relaciones interpersonales e íntimas.
4. Módulo de ocio y tiempo libre.
5. Módulo de manejo de crisis.

Respuesta correcta: 5. Módulo de manejo de crisis.